known brain damage

The above is a clinical trial exclusion criterion. Annotated with entity spans:
known [Condition: brain damage]